Clinical trial inclusion criterion:
Male or female patients at least 18 years of age.

Entity relations:
- Has_value("age", "at least 18 years")
- OR("Male", "female")